Severe acute illness as defined by Pitt bacteraemia score of >4

The above is a clinical trial exclusion criterion. Annotated with entity spans:
Severe acute illness as defined by [Measurement: Pitt bacteraemia score] of [Value: >4]